Ladd's procedure 與下列何者有關？
A. 腸轉位異常（malrotation of midgut）
B. 胃食道逆流（gastroesophageal reflux）
C. 肥厚性幽門阻塞（hypertrophic pyloric stenosis）
D. 十二指腸閉鎖（duodenal atresia） 54 「Double-bubble sign」與下列何種疾病有關？

正確答案：A. 腸轉位異常（malrotation of midgut）